Clinical trial exclusion criterion:
Facilities with a resident population with >=20% combative patients

Annotated entities:
- Measurement: "resident population"
- Value: ">=20%"
- Observation: "combative patients"